¿Cuál de los siguientes complejos enzimáticos cataliza la reducción de oxígeno molecular a agua durante la fosforilación oxidativa?
1. ATP sintasa.
2. Citocromo c oxidasa.
3. NADH-Q óxido-reductasa.
4. Q-citocromo c óxido-reductasa.
5. Succinato-Q reductasa.

Respuesta correcta: 2. Citocromo c oxidasa.